Clinical trial inclusion criterion:
Clinical Administered PTSD Scale 5 Monthly version Criteria A and >30 points

Annotated entities:
- Measurement: "Clinical Administered PTSD Scale"
- Value: ">30 points"
- Value: "Criteria A"